Rindopepimut is an analog of which growth factor?

Rindopepimut is an analog of EGFRvIII. It is being tested for treatment of glioblastoma multiforme